Clinical trial inclusion criterion:
Moderate to severe central or mixed central and obstructive sleep apnea, defined as an apnea-hypopnea index (AHI) 15 events per hour, with a central AHI >5 events/hour

Annotated entities:
- Condition: "obstructive sleep apnea"
- Condition: "central sleep apnea"
- Condition: "mixed central sleep apnea"
- Qualifier: "severe"
- Qualifier: "Moderate"
- Measurement: "apnea-hypopnea index"
- Measurement: "AHI"
- Value: "15 events per hour,"
- Measurement: "central AHI"
- Value: ">5 events/hour"